Clinical trial inclusion criterion:
have no prior CAD associated event (no prior myocardial infarction, acute coronary syndrome, coronary angiogram, or PCI),

Entity relations:
- Has_negation("CAD", "no")
- Subsumes("CAD", "myocardial infarction")
- OR("myocardial infarction", "acute coronary syndrome", "coronary angiogram", "PCI")